What is the substrate of the microbial enzyme inulinase?

The inulinase acts on the beta-(2,1)-D-fructoside links in inulin releasing D-fructose.